Clinical trial exclusion criterion:
Received more than one primary chemotherapy regimen.

Annotated entities:
- Drug: "primary chemotherapy regimen"
- Multiplier: "more than one"